Clinical trial inclusion criterion:
Patients scheduled for dental extraction and treated with edoxaban, apixaban, rivaroxaban or dabigatran

Annotated entities:
- Mood: "scheduled for"
- Procedure: "dental extraction"
- Drug: "edoxaban"
- Drug: "apixaban"
- Drug: "rivaroxaban"
- Drug: "dabigatran"